Clinical trial exclusion criterion:
Subjects currently taking medications that affect heart rate and rhythm (i.e. Ca++ channel blockers, nitrates, alpha- or beta-blockers).

Entity relations:
- Has_qualifier("medications", "that affect heart rhythm")
- Has_qualifier("medications", "that affect heart rate")
- Subsumes("medications", "Ca++ channel blockers")
- OR("Ca++ channel blockers", "beta-blockers", "nitrates", "alpha- blockers")